Clinical trial inclusion criterion:
Using one of the following asthma therapies prior to entry into the study: SABA inhaler alone (e.g. salbutamol) on an as required basis and/or Regular non-inhaled corticosteroid (ICS) controller medications for asthma (e.g. cromones or leukotriene receptor antagonists) and/or Previously treated with ICS (equipotent to inhaled budesonide <=400 micrograms (mcg) total daily dose). There must be no ICS use within 2 weeks of Visit 1 (Screening).

Annotated entities:
- Procedure: "asthma therapies"
- Temporal: "prior to entry into the study"
- Reference_point: "entry into the study"
- Drug: "SABA inhaler"
- Drug: "salbutamol"
- Drug: "leukotriene receptor antagonists"
- Drug: "cromones"
- Drug: "ICS"
- Drug: "budesonide"
- Value: "<=400 micrograms (mcg)"
- Procedure: "ICS"
- Negation: "no"
- Temporal: "within 2 weeks of Visit 1 (Screening)"
- Reference_point: "Visit 1 (Screening)"